下列何者與左心室心衰竭之重塑（remodeling）過程無關？
A. 細胞生長（cell growth）
B. 血管擴張（vasodilation）
C. 纖維化（fibrosis）
D. 細胞凋亡（apoptosis）

正確答案：B. 血管擴張（vasodilation）